Una mujer de 58 años ingresa en la Unidad de Corta Estancia Médica por un cuadro clínico que comenzó con un episodio de síncope y a continuación presentó sensación de mareo y disnea. En la exploración física se encuentra sudorosa, afebril a 126 latidos por minuto y a 30 respiraciones por minuto, con una presión arterial de 88/46 y una saturación de oxígeno del 85% mientras respira aire ambiente. La auscultación cardíaca muestra taquicardia sin soplos ni galope y la auscultación pulmonar es limpia. ¿Cuál, de entre los siguientes, le parece diagnóstico más probable?
1. Tromboembolismo pulmonar.
2. Accidente cerebrovascular agudo de territorio posterior.
3. Síndrome coronario agudo.
4. Shock hipovolémico.
5. Edema agudo de pulmón secundario a flutter auricular.

Respuesta correcta: 1. Tromboembolismo pulmonar.